Drowning

The above is a clinical trial exclusion criterion. Annotated with entity spans:
[Condition: Drowning]